Clinical trial exclusion criteria:
vulnerable study subjects such as described in Finnish law concerning clinical studies (disabled, children, pregnant or breast-feeding women, prisoners) will not be included.

Annotated entities:
- Condition: "vulnerable"
- Qualifier: "Finnish law concerning clinical studies"
- Condition: "disabled"
- Person: "children"
- Condition: "pregnant"
- Condition: "breast-feeding"
- Person: "women"
- Observation: "prisoners"